El resveratrol:
1. Es un lignano que se obtiene a partir de cultivos de determinadas cepas de Penicillium sp.
2. Es un estilbeno de origen vegetal que se obtiene a partir a partir de ácido hidroxicinamico y acetato.
3. Es un flavonoide de origen vegetal que se obtiene a partir del ácido cinámico y malonato.
4. Es un policétido obtenido a partir de cultivos de determinadas cepas Penicillium sp.

Respuesta correcta: 2. Es un estilbeno de origen vegetal que se obtiene a partir a partir de ácido hidroxicinamico y acetato.